Clinical trial exclusion criterion:
History of myelodysplasia

Annotated entities:
- Condition: "myelodysplasia"